一位 57 歲婦女因尿崩症導致高血鈉，其血清鈉離子濃度為 160 mEq/L（正常值 140 mEq/L），假設目前身體總水量（total body water）為 24 公升且無淨鈉流失，估計其水分流失約為多少公升？
A. 2.5
B. 3
C. 3.5
D. 4

正確答案：C. 3.5